Clinical trial exclusion criterion:
Planned surgery under regional anesthesia

Annotated entities:
- Procedure: "surgery"
- Procedure: "regional anesthesia"
- Mood: "Planned"